El tubo de diámetro muy pequeño y alrededor de 6 metros de longitud que discurre por la cara posterolateral del testículo y conecta con el conducto deferente, ¿se llama?
1. Próstata.
2. Epidídimo.
3. Uretra.
4. Epéndimo.
5. Túbulo seminífero.

Respuesta correcta: 2. Epidídimo.